Clinical trial exclusion criterion:
Soft or hard contact lenses use during the last month from inclusion day

Annotated entities:
- Device: "hard contact lenses"
- Device: "Soft contact lenses"
- Temporal: "during the last month from inclusion day"
- Reference_point: "inclusion day"